下列那一種子宮內膜增生（endometrial hyperplasia）的組織病理最易導致子宮內膜癌？
A. cystic without atypia
B. adenomatous without atypia
C. cystic with atypia
D. adenomatous with atypia

正確答案：D. adenomatous with atypia